No prior chemotherapy but prior adjuvant chemotherapy finished at least 6 months before enrollment was allowed. (but, prior adjuvant chemotherapy with capecitabine or S-1 or camptothecin analogues was excluded)

The above is a clinical trial inclusion criterion. Annotated with entity spans:
[Negation: No] [Temporal: prior] [Procedure: chemotherapy] but [Temporal: prior] [Procedure: adjuvant chemotherapy] finished [Temporal: at least 6 months before enrollment] [Negation: was allowed]. (but, [Temporal: prior] [Procedure: adjuvant chemotherapy] with [Drug: capecitabine] or [Drug: S-1] or [Drug: camptothecin analogues] was [Negation: excluded])